沉積在腎上腺微結節性增生（micronodular hyperplasia）最主要的色素為：
A. 黑色素
B. 血鐵素
C. 血色素
D. 脂褐質

正確答案：D. 脂褐質